no medical history of cardiovascular and respiratory disease

The above is a clinical trial inclusion criterion. Annotated with entity spans:
[Negation: no] [Temporal: medical history] of [Condition: cardiovascular] and [Condition: respiratory disease]